High risk for cardiac surgery (STS and logistic Euroscore ),

The above is a clinical trial inclusion criterion. Annotated with entity spans:
[Qualifier: High risk] for [Procedure: cardiac surgery] ([Qualifier: STS] and [Qualifier: logistic Euroscore] ),